Clinical trial exclusion criterion:
Uncontrolled medical problems including pulmonary, cardiovascular or orthopedic disease,

Entity relations:
- Has_qualifier("medical problems", "Uncontrolled")
- Subsumes("medical problems", "pulmonary disease")
- OR("pulmonary disease", "cardiovascular disease", "orthopedic disease")